Clinical trial exclusion criterion:
Use of oral, injected or implanted hormonal methods of contraception or other forms of hormonal contraception that have comparable efficacy (failure rate <1%), for example hormone vaginal ring or transdermal hormone contraception

Entity relations:
- OR("hormone vaginal ring", "transdermal hormone contraception")